¿Cómo se denomina el conjunto formado por dos metales muy diferentes en contacto eléctrico mediante un electrolito?:
1. Batería.
2. Pila galvánica.
3. Pila de concentración iónica.
4. Pila de concentración de oxígeno.

Respuesta correcta: 2. Pila galvánica.